Paciente que presenta diabetes mellitus, pérdida de peso, anemia y eritema migratorio necrolítico. El diagnóstico más probable es:
1. Somatostatinoma.
2. Insulinoma.
3. Vipoma.
4. Gastrinoma.
5. Glucagonoma.

Respuesta correcta: 5. Glucagonoma.